Clinical trial exclusion criterion:
Pregnancy or other Nicotine Replacement Therapy (NRT) contraindications

Entity relations:
- Subsumes("Nicotine Replacement Therapy", "NRT")
- AND("contraindications", "Nicotine Replacement Therapy")
- OR("Pregnancy", "contraindications")